Clinical trial inclusion criterion:
HAMA score=17

Annotated entities:
- Measurement: "HAMA score"
- Value: "=17"